Clinical trial inclusion criterion:
Patients who agree to participate in the study.

Annotated entities:
- Informed_consent: "Patients who agree to participate in the study."